下列有關外眼肌（extraocular muscles）之敘述，何者錯誤？
A. 四條直肌（rectus muscles）的起始點（origins）均在眼窩頂（apex）之 Zinn 氏環（annulus）
B. 四條直肌的終止點（insertions）均在眼球赤道部（equator）之前
C. 兩條斜肌（oblique muscles）的終止點均在眼球赤道部之後
D. 上、下直肌使眼球看直上、直下；上、下斜肌則分別負責看斜上、斜下

正確答案：D. 上、下直肌使眼球看直上、直下；上、下斜肌則分別負責看斜上、斜下